older than 80 years

The above is a clinical trial exclusion criterion. Annotated with entity spans:
[Value: older than 80] [Person: years]